Presence of any infertility factor other than anovulatory PCOS.

The above is a clinical trial exclusion criterion. Annotated with entity spans:
Presence of any [Condition: infertility factor] [Negation: other than] [Condition: anovulatory PCOS].